乾癬（psoriasis）是一種常見的慢性皮膚病，下列敘述何者正確？
A. 第一型乾癬往往好發於40歲以前，與HLA遺傳形態有關，而且治療效果往往較差
B. 乾癬患者有10~25%會併發有乾癬性關節炎
C. 乾癬病灶處表皮細胞分泌的抗菌蛋白β-defensin 2或cathelicidin（LL37）減少，因此皮表細菌感染機會增加，
D. HIV族群中乾癬的盛行率高於一般民眾，且嚴重性較高

正確答案：B. 乾癬患者有10~25%會併發有乾癬性關節炎